Which disease is caused by mutations in the gene CALR?

Somatic mutations of calreticulin (CALR) have been identified as a main disease driver of myeloproliferative neoplasms,